有一個 5 歲的男孩只會說「車子」、「出去玩」等簡單的辭彙，尚無法表達完整的句子，別人對他說話時他常常不看人，獨自遊戲，喜歡玩同樣的玩具，不喜歡參加團體活動；關於上述案例，下列敘述何者最不恰當？
A. 可能有智能障礙
B. 因為父母教養不當所以導致孩子發展異常
C. 最好接受腦波檢查
D. 記憶力或音樂方面的能力很強

正確答案：B. 因為父母教養不當所以導致孩子發展異常